Cerebral palsy of any types caused by Neonatal Jaundice

The above is a clinical trial inclusion criterion. Annotated with entity spans:
[Condition: Cerebral palsy] of any types caused by [Condition: Neonatal Jaundice]